Uncontrolled hypertension (medication non-compliance or past 3 months with a diastolic reading of 105 as verified by compartment pressure of the rectus sheath (CPRS))

The above is a clinical trial exclusion criterion. Annotated with entity spans:
[Condition: Uncontrolled hypertension] ([Condition: medication non-compliance] or [Temporal: past 3 months] with a [Measurement: diastolic reading] of [Value: 105] [Qualifier: as verified by compartment pressure of the rectus sheath (CPRS)])